Elevated total cholesterol (>350 mg/dL) and/or triglycerides (>500 ng/dL) at time of possible conversion

The above is a clinical trial exclusion criterion. Annotated with entity spans:
[Value: Elevated] [Measurement: total cholesterol] ([Value: >350 mg/dL]) and/or [Measurement: triglycerides] ([Value: >500 ng/dL]) [Temporal: at time of possible conversion]